patients undergoing venous malformation embolization operation through general anesthesia.

The above is a clinical trial inclusion criterion. Annotated with entity spans:
patients undergoing [Procedure: venous malformation embolization operation] through [Procedure: general anesthesia].